一位 60 歲農夫，農忙時被樹葉刮傷眼球。數日後，因眼睛疼痛就診。細隙燈檢查發現角膜中央有一 4 毫米大的白色浸潤（infiltration），病灶邊緣模糊，並有數個衛星狀的小病灶（satellite lesions）。 下列那一項處置或敘述錯誤？
A. 病人需接受角膜病灶之刮除抹片（scraping smear）及微生物培養
B. 最可能的診斷是黴菌性角膜炎
C. 應給予類固醇點眼治療
D. 若藥物治療無效時，則需手術治療

正確答案：C. 應給予類固醇點眼治療